Clinical trial exclusion criterion:
Chemotherapy and radiotherapy

Annotated entities:
- Procedure: "Chemotherapy"
- Procedure: "radiotherapy"